Clinical trial exclusion criterion:
Known severe heart failure, classified as NYHA 4.

Entity relations:
- Has_qualifier("heart failure", "severe")
- Has_value("NYHA", "4")
- Subsumes("heart failure", "NYHA")